Eligible for heat treatment

The above is a clinical trial inclusion criterion. Annotated with entity spans:
[Mood: Eligible for] [Procedure: heat treatment]